Clinical trial exclusion criterion:
Meet criteria for a current manic episode based on structured clinical interview

Annotated entities:
- Condition: "manic episode"